previous treated dupuytrens contracture same hand

The above is a clinical trial exclusion criterion. Annotated with entity spans:
[Temporal: previous] [Qualifier: treated] [Condition: dupuytrens contracture] [Qualifier: same hand]